Clinical trial exclusion criterion:
Psoriasis or psoriasis arthropathy

Annotated entities:
- Condition: "Psoriasis"
- Condition: "psoriasis arthropathy"